Which java utility has been developed for class hidden markov models?

JUCHMME is an open-source software package in Java designed to fit arbitrary custom Hidden Markov Models (HMMs) with a discrete alphabet of symbols.